Clinical trial exclusion criterion:
History or known presence of potential metabolic causes of myelopathy (e.g., untreated vitamin B12 deficiency)

Entity relations:
- Has_qualifier("vitamin B12 deficiency", "untreated")
- AND("metabolic causes", "myelopathy")
- Subsumes("metabolic causes", "vitamin B12 deficiency")